Clinical trial inclusion criterion:
Symptomatic: Baseline Dyspnea Index =8 and answer "in the morning" when asked about what time of day their COPD symptoms are worst.

Annotated entities:
- Measurement: "Baseline Dyspnea Index"
- Value: "=8"
- Observation: "what time of day their COPD symptoms are worst"
- Value: "in the morning"